El zumo de pomelo es:
1. Un potente inductor enzimático del citocromo P450 (CYP3A4).
2. Un potente inhibidor enzimático del citocromo P450 (CYP3A4).
3. Un promotor de la absorción de fármacos administrados por vía oral.
4. Un alimento aconsejable para incrementar la biodisponibilidad de fármacos de naturaleza ácida.
5. Un alimento sin consecuencia en la cinética de disposición de fármacos eliminados por metabolismo en el que está implicado el citocromo P450.

Respuesta correcta: 2. Un potente inhibidor enzimático del citocromo P450 (CYP3A4).